Scar diathesis;

The above is a clinical trial exclusion criterion. Annotated with entity spans:
[Condition: Scar diathesis];